Clinical trial exclusion criterion:
Nephrotic range proteinuria (urinary protein > 3.5 gm/day)

Annotated entities:
- Qualifier: "Nephrotic range"
- Condition: "proteinuria"
- Measurement: "urinary protein"
- Value: "> 3.5 gm/day"